What is the role of the IRE1a-XBP1 pathway?

The IRE1a-XBP1 pathway is a conserved adaptive mediator of the unfolded protein response.